下列何者為女性高雄性素（Hyperandrogenism）及多毛症（Hirsutism）最常見的原因？
A. 庫欣氏症（Cushing Syndrome）
B. 多囊性卵巢症候群（PCOS）
C. 卵巢雄性素分泌瘤（Androgen-producing ovarian neoplasms）
D. 先天性腎上腺增生（Congenital adrenal hyperplasia）

正確答案：B. 多囊性卵巢症候群（PCOS）